Which is the phosphorylated residue in the promoter paused form of RNA polymerase II?

The promoter paused form of RNA polymerase II is phosphorylated on serine 5 residues of the C-terminal heptapeptide repeat domain (CTD) of the largest subunit.